Platelet count greater than or equal to 100 x 10^9/L

The above is a clinical trial inclusion criterion. Annotated with entity spans:
[Measurement: Platelet count] [Value: greater than] or [Value: equal to 100 x 10^9/L]